Pancreatic disease;

The above is a clinical trial exclusion criterion. Annotated with entity spans:
[Condition: Pancreatic disease];